Clinical trial inclusion criterion:
Patient age >= 18 years

Entity relations:
- Has_value("Patient age", ">= 18 years")